Clinical trial inclusion criterion:
Body mass index (BMI) 18 to 30 kg/m2 inclusive

Annotated entities:
- Measurement: "Body mass index (BMI)"
- Value: "18 to 30 kg/m2 inclusive"